patient with severe renal failure;

The above is a clinical trial exclusion criterion. Annotated with entity spans:
patient with [Qualifier: severe] [Condition: renal failure];